Clinical trial exclusion criterion:
Diagnosis of ankle fracture or ligament rupture

Annotated entities:
- Condition: "ankle fracture"
- Condition: "ligament rupture"